12 歲男童清晨起床後第一泡尿可見沖不掉的泡泡，之前並無呼吸感染症狀，下肢無水腫現象，單次尿液檢驗發現尿中有蛋白≥300 mg/dL，尿液之蛋白/肌酸酐（protein/Creatinine）比值為 0.35。請問何者為下一步最合宜的對策？
A. 先給低劑量之類固醇，再追蹤其蛋白尿變化
B. 收集休息平躺後的尿液及運動後的尿液作尿液分析
C. 腎切片檢查
D. 建議低蛋白飲食，再追蹤其蛋白尿變化

正確答案：B. 收集休息平躺後的尿液及運動後的尿液作尿液分析